A formal diagnosis of Autism or Pervasive Developmental Disorder not otherwise specified (PDD-NOS), given by a child neurologist.

The above is a clinical trial inclusion criterion. Annotated with entity spans:
A formal diagnosis of [Condition: Autism] or [Condition: Pervasive Developmental Disorder not otherwise specified] ([Condition: PDD-NOS]), [Non-query-able: given by a child neurologist].